other things affecting hand function

The above is a clinical trial exclusion criterion. Annotated with entity spans:
[Condition: other things] [Qualifier: affecting hand function]